Recipient is Age = 18 years

The above is a clinical trial inclusion criterion. Annotated with entity spans:
Recipient is [Person: Age] [Value: = 18 years]